normal blood pressure or controlled hypertension;

The above is a clinical trial inclusion criterion. Annotated with entity spans:
[Condition: normal blood pressure] or [Condition: controlled hypertension];